Clinical trial exclusion criterion:
Walking capacity significantly limited by conditions other than claudication including leg (joint/musculoskeletal, neurologic) and systemic (heart, lung disease) pathology,

Annotated entities:
- Measurement: "Walking capacity"
- Value: "significantly limited"
- Condition: "claudication"
- Negation: "other than"
- Condition: "leg pathology"
- Condition: "systemic pathology"
- Qualifier: "joint"
- Qualifier: "musculoskeletal"
- Qualifier: "neurologic"
- Condition: "heart disease"
- Condition: "lung disease"
- Condition: "conditions other than claudication"
- Qualifier: "other than claudication"